Clinical trial inclusion criterion:
7. Significant stenosis has been defined as a stenosis of more than 50% in luminal diameter (in at least one view, on visual interpretation or preferably by QCA);

Entity relations:
- Has_value("stenosis", "more than 50% in luminal diameter")
- Subsumes("Significant stenosis", "stenosis")